某研究者想檢定某基因多型性（AA／AG組相對GG組）是否與口腔癌的發生有關，在某醫院有 200 名口腔癌患者參與此研究，每位口腔癌患者都配對 1 名沒有口腔癌的健康者，分別測量其基因型，下列統計分析方法何者最恰當？
A. 線性迴歸
B. 獨立樣本之卡方檢定
C. 配對t檢定
D. McNemar卡方檢定

正確答案：D. McNemar卡方檢定